Acute infection/inflammation (Temperature > 101.5 F, and/or WBC> 15, 000)

The above is a clinical trial exclusion criterion. Annotated with entity spans:
[Qualifier: Acute] [Condition: infection]/[Condition: inflammation] ([Measurement: Temperature] [Value: > 101.5 F], and/or [Measurement: WBC][Value: > 15, 000])